Clinical trial exclusion criterion:
Patients with active alcohol dependence

Annotated entities:
- Condition: "alcohol dependence"